Clinical trial inclusion criterion:
5. Female patients of childbearing potential must have a negative pregnancy test at screening and must agree to use hormonal contraceptive, intrauterine device, diaphragm with spermicide, condom with spermicide, or abstinence throughout until 2 weeks after the last administration of study drug

Annotated entities:
- Parsing_Error: "5."
- Condition: "childbearing potential"
- Measurement: "pregnancy test"
- Value: "negative"
- Temporal: "at screening"
- Reference_point: "screening"
- Drug: "hormonal contraceptive"
- Device: "intrauterine device"
- Device: "diaphragm with spermicide"
- Device: "condom with spermicide"
- Observation: "abstinence"
- Temporal: "throughout until 2 weeks after the last administration of study drug"
- Reference_point: "last administration of study drug"
- Person: "Female"